55歲女性因眼睛容易感到疲勞、出現燒熱感前來就診。另外病人抱怨口腔內也會有燒熱感，咀嚼及吞嚥乾的食物時會有困難。身體檢查發現兩側耳下腺腫脹但不會感覺疼痛。血清檢查發現病人血中抗SS-A與抗SS-B抗體升高。有關此疾病之敘述，下列何者正確？
A. 唾液腺會有很多淋巴細胞（lymphocyte）浸潤，主要以CD8陽性T淋巴細胞為主
B. 應立即進行腎臟切片檢查以評估疾病嚴重度
C. 此類病人常會有類風濕因子（rheumatoid factor）升高現象
D. 此類病人常會有抗染色體中節抗體（anti-centromere antibody）升高現象

正確答案：C. 此類病人常會有類風濕因子（rheumatoid factor）升高現象